Hombre de 34 años que consulta por fiebre y malestar general. En la historia clínica se recogen como antecedentes relaciones homosexuales desde hace 4 meses con una nueva pareja. 2 meses antes de la consulta actual tuvo una lesión ulcerosa en el glande, indolora, con adenopatías inguinales bilaterales, todo ello autolimitado. Se solicitan estudios serológicos con los siguientes resultados: HIV negativo, RPR 1/320, TPHA 1/128. ¿Qué tratamiento indicaría en este paciente?
1. Ninguno.
2. Penicilina G intravenosa, 24 MU cada día durante 14 días.
3. Penicilina Benzatina 2,4 MU intramusculares, tres dosis en tres semanas consecutivas.
4. Ceftriaxona 2 gramos intramusculares en una única dosis.
5. Penicilina Benzatina 2,4 MU intramuscular en una única dosis.

Respuesta correcta: 5. Penicilina Benzatina 2,4 MU intramuscular en una única dosis.